La replicación inicial del virus varicela-zóster tiene lugar en:
1. El bazo.
2. El hígado.
3. Las vías respiratorias y ganglios linfáticos regionales.
4. Epitelios orales.

Respuesta correcta: 3. Las vías respiratorias y ganglios linfáticos regionales.